Clinical trial exclusion criterion:
Albumin < 3g/dL at the time of enrollment

Entity relations:
- Has_value("Albumin", "< 3g/dL")